Clinical trial exclusion criterion:
Evidence of congenital heart disease

Entity relations:
- Has_mood("congenital heart disease", "Evidence of")